What is Chrysophanol?

Chrysophanol is a unique anthraquinone having broad-spectrum therapeutic potential along with ecological importance. A plethora of literature is available on the pharmacological properties of chrysophanol, which include anticancer,  anti-inflammatory, and antimicrobial activities.